Clinical trial exclusion criterion:
On systemic antibiotics or with an active bacterial infection at the time of surgery

Annotated entities:
- Drug: "systemic antibiotics"
- Condition: "bacterial infection"
- Qualifier: "active"
- Temporal: "at the time of surgery"
- Reference_point: "the time of surgery"
- Procedure: "surgery"